Clinical trial inclusion criterion:
Age = 18 years

Entity relations:
- Has_value("Age", "= 18 years")